Clinical trial exclusion criterion:
Atrial fibrillation with a heart rate > 120/min.

Entity relations:
- Has_value("heart rate", "> 120/min")
- AND("Atrial fibrillation", "heart rate")